Clinical trial inclusion criterion:
persistent HbA1c levels = 7.5% (58 mmol/mol) despite optimized education therapy,

Annotated entities:
- Measurement: "HbA1c levels"
- Multiplier: "persistent"
- Value: "= 7.5%"
- Value: "58 mmol/mol"
- Procedure: "optimized education therapy"